Clinical trial exclusion criterion:
Active opportunistic infections

Entity relations:
- Has_qualifier("opportunistic infections", "Active")